Clinical trial inclusion criterion:
heart failure NYHA II-IV

Annotated entities:
- Condition: "heart failure"
- Measurement: "NYHA"
- Value: "II-IV"